Clinical trial inclusion criterion:
Height 150 - 180 cm

Entity relations:
- Has_value("Height", "150 - 180 cm")